What is Taupathy?

Taupathy is an autosomal-dominant neurodegenerative disease characterized by the progressive degeneration of substantia nigra pars compacta (SNpc) dopaminergic neurones and is characterized by loss of motor, sensory, and sensory function.